individuals engaging in transactional sex (i.e sex for money, drugs, or housing)

The above is a clinical trial inclusion criterion. Annotated with entity spans:
individuals engaging in [Observation: transactional sex] (i.e [Observation: sex for money], drugs, or housing)